Clinical trial inclusion criterion:
Indication for Fresh Embryo transfer

Entity relations:
- Has_mood("Fresh Embryo transfer", "Indication for")